Which disease is treated with lucinactant?

Lucinactant us used for the prevention of respiratory distress syndrome in premature infants.